Clinical trial exclusion criterion:
Not appropriate for oral antidiabetic agent

Annotated entities:
- Negation: "Not"
- Observation: "appropriate"
- Drug: "oral antidiabetic agent"